Pregnancy or lactation.

The above is a clinical trial exclusion criterion. Annotated with entity spans:
[Condition: Pregnancy] or [Condition: lactation].